Clinical trial inclusion criterion:
Require no red blood cell transfusion or dependent on <4 units within 8 weeks prior to screening

Entity relations:
- Has_multiplier("red blood cell transfusion", "<4 units")
- Has_negation("red blood cell transfusion", "no")
- Has_temporal("red blood cell transfusion", "within 8 weeks prior to screening")